Pseudoarthrosis

The above is a clinical trial inclusion criterion. Annotated with entity spans:
[Condition: Pseudoarthrosis]